Clinical trial exclusion criterion:
Are pregnant

Annotated entities:
- Condition: "pregnant"